Clinical trial exclusion criterion:
HFpEF: prior history of LVEF below 50%, acute decompensated HF, moderate or greater valvular disease, significant cardiac arrhythmias, pericardial disease, congenital heart disease, primary pulmonary hypertension

Entity relations:
- Has_value("LVEF", "below 50%")
- Has_temporal("LVEF", "prior history of")
- Has_qualifier("decompensated HF", "acute")
- Has_qualifier("valvular disease", "moderate")
- Has_qualifier("cardiac arrhythmias", "significant")
- AND("HFpEF", "LVEF")
- OR("moderate", "greater")
- OR("LVEF", "congenital heart disease", "pericardial disease", "cardiac arrhythmias", "valvular disease", "decompensated HF", "primary pulmonary hypertension")